Clinical trial exclusion criterion:
Allergy to LA

Annotated entities:
- Condition: "Allergy"
- Drug: "LA"